In which cell organelle is the SAF-A protein localized?

SAF-A is localized to the nucleus where it promotes ribosomal RNA (rRNA) transcription thereby stimulating cell growth.